糖尿病所造成之周邊神經病變不可能出現何種症狀？
A. 肌腱反射增強
B. 振動及關節位置的感覺消失
C. 近端肌肉（proximal muscle）無力及萎縮
D. 自主神經症狀

正確答案：A. 肌腱反射增強